相對於開腹手術，施行腹腔鏡闌尾切除手術（laparoscopic appendectomy）的優點不包括下列何者？
A. 減少住院天數
B. 縮短手術時間
C. 便於發現腹腔內其他可能疾病
D. 較低傷口感染率

正確答案：B. 縮短手術時間